Clinical trial exclusion criterion:
Breast Carcinoma

Annotated entities:
- Condition: "Breast Carcinoma"